Class-defining mutations in which genes drive FLT3-ITD-mutant AML?

NPM1, RUNX1, CEBPA, MLL